Clinical trial inclusion criterion:
Female patients older than 18 years.

Entity relations:
- Has_value("years", "older than 18 years")